Clinical trial exclusion criterion:
women undergoing cesarean section at less than 37 weeks of gestation.

Annotated entities:
- Person: "women"
- Procedure: "cesarean section"
- Temporal: "less than 37 weeks"
- Measurement: "gestation"